Clinical trial inclusion criteria:
Type 2 diabetic patients
Age = 50
Glycemic control: HbA1c = 10.0%
10 = Beck Depression Inventory (BDI) <30 points
Participants who can undergo contraception in case of being in childbearing period
Understands the study procedure, alternatives, and risks and voluntarily agrees to participate by giving written informed concent

Annotated entities:
- Condition: "Type 2 diabetic"
- Person: "Age"
- Value: "= 50"
- Measurement: "HbA1c"
- Value: "= 10.0%"
- Measurement: "Beck Depression Inventory (BDI)"
- Value: "<30 points"
- Pregnancy_considerations: "Participants who can undergo contraception in case of being in childbearing period"
- Post-eligibility: "Understands the study procedure, alternatives, and risks and voluntarily agrees to participate by giving written informed concent"